Use of Ginkgo biloba or St. John's Wort within 14 days before first dose of study drug

The above is a clinical trial exclusion criterion. Annotated with entity spans:
Use of [Drug: Ginkgo biloba] or [Drug: St. John's Wort] [Temporal: within 14 days before first dose of study drug]